Prohormone轉化為hormone的過程，主要在何處進行？
A. Golgi apparatus
B. mitochondrion
C. peroxisome
D. centriole

正確答案：A. Golgi apparatus